Clinical trial exclusion criterion:
CAD

Annotated entities:
- Condition: "CAD"